Clinical trial exclusion criteria:
Moderate or severe endometriosis.
Hydrosalpinx.
Uterine abnormalities or myoma.
Previous uterine surgery.

Annotated entities:
- Condition: "endometriosis"
- Qualifier: "severe"
- Qualifier: "Moderate"
- Condition: "Hydrosalpinx"
- Condition: "Uterine abnormalities"
- Condition: "myoma"
- Procedure: "uterine surgery"